Clinical trial exclusion criterion:
Unwillingness to participate in the study with additional imaging protocols

Annotated entities:
- Informed_consent: "Unwillingness to participate in the study with additional imaging protocols"